El documento que sienta los principios de la Bioética respecto a la autonomía de las personas, beneficencia y justicia, y fija los requisitos básicos del consentimiento informado, la valoración de riesgos y beneficios y la selección de los sujetos es:
1. La Declaración de Helsinki de 1964.
2. El Informe Belmont de 1978.
3. Los principios de la Ética Biomédica de 1979.
4. El Convenio de Oviedo de 1997.
5. El Código Deontológico.

Respuesta correcta: 2. El Informe Belmont de 1978.